Clinical trial inclusion criterion:
Body mass index (BMI) =18 to =30 kg/m2

Entity relations:
- Subsumes("Body mass index", "BMI")
- Has_value("Body mass index", "=18 to =30 kg/m2")